Clinical trial exclusion criterion:
Lung resection or transplantation: Subjects with lung volume reduction surgery within the 12 months prior to Screening or having had a lung transplant.

Annotated entities:
- Procedure: "Lung resection"
- Procedure: "transplantation"
- Procedure: "lung volume reduction surgery"
- Temporal: "within the 12 months prior to Screening"
- Reference_point: "Screening"
- Procedure: "lung transplant"
- Condition: "having had a lung transplant"
- Condition: "with lung volume reduction surgery"